臨床上用於治療心絞痛之血管舒張劑，何者之作用機轉是經由 cGMP 媒介？
A. Nifedipine
B. Enalapril
C. Minoxidil
D. Nitroglycerin

正確答案：D. Nitroglycerin